Patient has received an organ transplant or is on a waiting list for an organ transplant

The above is a clinical trial inclusion criterion. Annotated with entity spans:
Patient has received an [Procedure: organ transplant] or [Mood: is on a waiting list] for an [Procedure: organ transplant]